English speaking

The above is a clinical trial inclusion criterion. Annotated with entity spans:
[Observation: English speaking]